Clinical trial inclusion criterion:
Agree to abide by the study protocol and its restrictions and be able to complete all aspects of the study, including all visits and tests

Annotated entities:
- Post-eligibility: "Agree to abide by the study protocol and its restrictions and be able to complete all aspects of the study, including all visits and tests"